Clinical trial inclusion criterion:
Patient meets ONE of the following criteria: baseline PSA < 4.0ng/mL (no prostate biopsy required) OR baseline PSA >/= 4 ng/mL AND a negative prostate biopsy (minimum 12 core biopsy) within the prior 12 months

Annotated entities:
- Measurement: "PSA"
- Temporal: "baseline"
- Value: "< 4.0ng/mL"
- Measurement: "PSA"
- Temporal: "baseline"
- Value: ">/= 4 ng/mL"
- Measurement: "prostate biopsy"
- Value: "negative"
- Multiplier: "minimum 12"
- Procedure: "core biopsy"
- Temporal: "within the prior 12 months"